La ribonucleótido reductasa:
1. Interviene en la síntesis de los desoxirribonucleótidos.
2. Utiliza el NADPH como coenzima.
3. Es un sistema enzimático.
4. Actúa en colaboración con la tiorredoxina.
5. Todo lo anterior es cierto.

Respuesta correcta: 5. Todo lo anterior es cierto.